Clinical trial exclusion criterion:
Cardiovascular symptoms (angina, limiting dyspnoea during normal physical activity)

Entity relations:
- AND("Cardiovascular symptoms", "angina")
- OR("angina", "dyspnoea")